Clinical trial exclusion criterion:
Aortic regurgitation mild or greater

Entity relations:
- Has_qualifier("Aortic regurgitation", "mild or greater")